Clinical trial exclusion criterion:
Primary indication for ACE inhibitor use, i.e. Congestive Heart Failure, CAD, diabetes

Annotated entities:
- Drug: "ACE inhibitor"
- Condition: "Primary indication for ACE inhibitor use"
- Condition: "Congestive Heart Failure"
- Condition: "CAD"
- Condition: "diabetes"